Clinical trial inclusion criteria:
Children between the ages of 4-18 with incomplete ASIA C or D spinal cord injuries at least 12 months before study enrolment
Non-ambulatory or 'exercise only' ambulators with or without assistive devices
Normal motor and cognitive development up to time of injury
Medical Stability

Annotated entities:
- Person: "ages"
- Value: "4-18"
- Person: "Children"
- Condition: "spinal cord injuries"
- Measurement: "ASIA"
- Value: "C or D"
- Qualifier: "incomplete"
- Temporal: "at least 12 months before study enrolment"
- Reference_point: "study enrolment"
- Observation: "Non-ambulatory"
- Observation: "'exercise only' ambulators"
- Device: "assistive devices"
- Measurement: "cognitive development"
- Value: "Normal"
- Measurement: "motor development"
- Temporal: "up to time of injury"
- Reference_point: "time of injury"
- Condition: "Medical Stability"